Clinical trial inclusion criterion:
Typical AMD and PCV patients

Annotated entities:
- Condition: "PCV patients"
- Condition: "AMD"